對於外傷後脊髓空洞症（post-traumatic syringomyelia），下列何種影像檢查最具診斷價值？
A. 電腦斷層掃描（CT scan）
B. 核磁共振影像檢查（MRI）
C. 脊髓攝影（myelography）
D. 超音波檢查（ultrasonography）

正確答案：B. 核磁共振影像檢查（MRI）